Hypersensitivity to B-lactams

The above is a clinical trial exclusion criterion. Annotated with entity spans:
[Condition: Hypersensitivity] to [Drug: B-lactams]